Clinical trial exclusion criterion:
Inability to swallow oral medication

Entity relations:
- AND("Inability to swallow oral medication", "oral medication")